Clinical trial inclusion criterion:
Patients with symptomatic FAI

Annotated entities:
- Condition: "FAI"
- Qualifier: "symptomatic"